Todas la afirmaciones siguientes describen características del enlace peptídico EXCEPTO:
1. Tiene una configuración trans.
2. Es polar pero sin carga.
3. Forma un enlace sencillo uniendo directamente los carbonos α de aminoácidos adyacentes.
4. No presenta rotación alrededor del enlace.
5. Es plano.

Respuesta correcta: 3. Forma un enlace sencillo uniendo directamente los carbonos α de aminoácidos adyacentes.